右胃動脈（right gastric artery）由下列何者發出？
A. 肝總動脈（common hepatic artery）
B. 腹主動脈（abdominal aorta）
C. 脾動脈（splenic artery）
D. 腸繫膜上動脈（superior mesenteric artery）

正確答案：A. 肝總動脈（common hepatic artery）